Clinical trial exclusion criterion:
Chronic pain more than 3 months

Entity relations:
- Has_temporal("Chronic pain", "more than 3 months")